下列關於肝臟（liver）發育之敘述，何者正確？
A. 由中腸（midgut）衍生而來
B. 肝索（hepatic cord）由中胚層衍生而來
C. 庫弗氏細胞（Kupffer cell）由內胚層衍生而來
D. 胚胎發育第六週開始有造血活動

正確答案：D. 胚胎發育第六週開始有造血活動